Clinical trial exclusion criterion:
Expected life expectancy < 1 year

Annotated entities:
- Observation: "Expected life expectancy"
- Value: "< 1 year"